La proporción fenotípica dihíbrida en la epistasia simple recesiva es:
1. 9:3:4.
2. 12:3:1.
3. 9:7.
4. 13:3.

Respuesta correcta: 1. 9:3:4.